Entre los factores exógenos que favorecen la aparición de gota están los fármacos. De los siguientes indicados ¿cuál considera Vd. que NO favorece la hiperuricemia?
1. El ácido acetilsalicílico a dosis inferiores a 1g diario.
2. La hidroclorotiacida.
3. La ciclosporina A.
4. El etambutol.
5. Los estrógenos.

Respuesta correcta: 5. Los estrógenos.